Clinical trial exclusion criterion:
Women undergoing cesarean section with general anesthesia will be excluded, because carbetocin is licensed for use with regional anaesthesia only.

Annotated entities:
- Person: "Women"
- Procedure: "cesarean section"
- Qualifier: "general anesthesia"
- Non-representable: "because carbetocin is licensed for use with regional anaesthesia only"